Chronic Heart failure subjects with medical history of cardiac disease or other related cardiovascular disease.

The above is a clinical trial inclusion criterion. Annotated with entity spans:
[Condition: Chronic Heart failure] subjects with medical history of [Condition: cardiac disease] or other [Qualifier: related] [Condition: cardiovascular disease].